壁層胸膜（parietal pleura）的淋巴，最可能回流到下列那個淋巴結（lymph node）？
A. 腋（axillary）
B. 支氣管肺（bronchopulmonary）
C. 氣管支氣管（tracheobronchial）
D. 支氣管縱隔（bronchomediastinal）

正確答案：A. 腋（axillary）